Clinical trial exclusion criterion:
Patient is suffering with unstable angina in last one week.

Annotated entities:
- Condition: "unstable angina"
- Temporal: "last one week"